7. Other serious medical illness likely to interfere with study participation or with the ability to complete the trial by the judgment of the investigator (e.g. unstable psychiatric condition).

The above is a clinical trial exclusion criterion. Annotated with entity spans:
[Parsing_Error: 7.] [Condition: Other] [Qualifier: serious] medical illness [Context_Error: likely to interfere with study participation] or with the ability to complete the trial [Subjective_judgement: by the judgment of the investigator] (e.g. [Qualifier: unstable] [Condition: psychiatric condition]).